耳硬化症（Otosclerosis）引起之傳導性聽力障礙，主要是下列何者受到耳硬化症病灶之侵犯？
A. 鼓膜
B. 鎚骨
C. 砧骨
D. 鐙骨

正確答案：D. 鐙骨